What is the active ingredient in the most common hand sanitizer?

The active ingredient in the most common hand sanitizer is ethanol, benzalkonium chloride, isopropanol, alcohol, bzk, 70% ethanol.